Clinical trial exclusion criterion:
any contraindication for magnetic resonance imaging (MRI)

Entity relations:
- Subsumes("magnetic resonance imaging", "MRI")
- AND("contraindication", "magnetic resonance imaging")